Clinical trial exclusion criterion:
Planned cardiac surgery or planned major non cardiac surgery

Entity relations:
- Has_mood("cardiac surgery", "Planned")
- Has_qualifier("non cardiac surgery", "major")
- Has_mood("non cardiac surgery", "planned")
- OR("cardiac surgery", "non cardiac surgery")